Los pescados grasos, comúnmente llamados azules, son los que contienen algo más del 10% de grasa. ¿Cuál de los siguientes es un pescado magro y, por lo tanto, con un aporte de grasa inferior?
1. Sardina.
2. Anguila.
3. Salmón.
4. Lenguado.
5. Caballa.

Respuesta correcta: 4. Lenguado.